Clinical trial exclusion criterion:
Psychiatric disorders

Annotated entities:
- Condition: "Psychiatric disorders"